¿Cuál de las siguientes afirmaciones es correcta?:
1. El triptófano es un aminoácido alifático.
2. La leucina es un aminoácido alifático.
3. La treonina es un aminoácido ácido.
4. La arginina es un aminoácido ácido.

Respuesta correcta: 2. La leucina es un aminoácido alifático.